What is formative pluripotency?

Formative pluripotency is an intermediate stage in the developmental continuum. It's a bit of a misnomer. The term "formative" comes from the word "formal" which is used to refer to an intermediate state that isn't fully formed.